一位 4 歲男童被發現手指末端有脫皮變化前來就診，2 週前該男童曾經發燒 5 天，身上出現紅疹，其他病徵不明，並未接受治療。下列那一項檢查最無必要性？
A. echocardiogram
B. throat bacteria culture
C. anti-streptolysin O titer
D. rickettsia antibody

正確答案：D. rickettsia antibody